Only children well enough to be discharged to home at the conclusion of the PED visit are eligible.

The above is a clinical trial inclusion criterion. Annotated with entity spans:
Only children [Condition: well enough to be discharged to home] [Temporal: at the conclusion of the PED visit] are eligible.